狗在非麻醉的情況下，若將大量液體由靜脈迅速灌注循環系統中，其心跳增加的主要原因為何？
A. Bainbridge 反射作用高於感壓反射作用
B. 感壓反射作用高於 Bainbridge 反射作用
C. 中樞化學反射作用高於周邊化學反射作用
D. 周邊化學反射作用高於中樞化學反射作用

正確答案：A. Bainbridge 反射作用高於感壓反射作用